Clinical trial exclusion criterion:
Contraindication to enoxaparin

Entity relations:
- AND("Contraindication", "enoxaparin")